Clinical trial exclusion criterion:
Patients who are currently receiving prasugrel

Annotated entities:
- Drug: "prasugrel"